Mediante los métodos angulares utilizados para evaluar las propiedades de flujo de un polvo se determina:
1. La facilidad con la que el sólido se pone en movimiento.
2. El ángulo de reposo.
3. La velocidad de flujo.
4. La resistencia al desplazamiento.
5. La densidad del polvo.

Respuesta correcta: 2. El ángulo de reposo.